關於左心室之冠狀動脈血流供應，下列何者正確？
A. 平均分配於心臟收縮期及舒張期
B. 主要在心臟舒張期
C. 主要在心臟收縮期
D. 往往依收縮壓高低而有所不同

正確答案：B. 主要在心臟舒張期